Clinical trial exclusion criterion:
Previous significant adverse reaction to naltrexone or diluent

Entity relations:
- Has_qualifier("adverse reaction", "significant")
- Has_temporal("adverse reaction", "Previous")
- AND("adverse reaction", "naltrexone")
- OR("naltrexone", "diluent")